Nonspecific immunoglobulin was injected within one month

The above is a clinical trial exclusion criterion. Annotated with entity spans:
[Drug: Nonspecific immunoglobulin] was injected [Temporal: within one month]